Satisfying the 1987 American College of Rheumatology (ACR) criteria for RA

The above is a clinical trial inclusion criterion. Annotated with entity spans:
Satisfying the [Qualifier: 1987 American College of Rheumatology (ACR) criteria] for [Condition: RA]